Clinical trial exclusion criterion:
Active hepatitis virus infection

Entity relations:
- Has_temporal("hepatitis virus infection", "Active")